Which type of pluripotency is Otx2 associated with?

Otx2 is an intrinsic determinant of the embryonic stem cell state and is required to stabilize the EpiSC state by suppressing the Mesendoderm to Neuron fate switch.